6. For females of reproductive potential, use of at least one barrier contraceptive and a second effective birth control method during the study and for at least two weeks after the last dose. For male subjects, use of appropriate contraception (e.g., condoms), so their female partners of reproductive potential do not become pregnant during the study and for at least two weeks after the last dose

The above is a clinical trial inclusion criterion. Annotated with entity spans:
[Parsing_Error: 6.] For [Person: females] of [Condition: reproductive potential], use of [Multiplier: at least one] [Device: barrier contraceptive] and a [Qualifier: second] [Qualifier: effective] [Device: birth control method] [Temporal: during the study] and [Temporal: for at least two weeks after the last dose]. [Post-eligibility: For male subjects, use of appropriate contraception (e.g., condoms), so their female partners of reproductive potential do not become pregnant during the study and for at least two weeks after the last dose]